El virus (virusoide) de la hepatitis D (agente δ) precisa co-infectar con el virus de la hepatitis:
1. A.
2. B.
3. C.
4. E.
5. G.

Respuesta correcta: 2. B.